Myocardial infarction and heart surgery up to three months before the survey;

The above is a clinical trial exclusion criterion. Annotated with entity spans:
[Condition: Myocardial infarction] and [Procedure: heart surgery] [Temporal: up to three months before the survey];